¿Para qué tipo de adicción se ha demostrado ser un tratamiento bien establecido el programa de reforzamiento comunitario más terapia de incentivo?
1. Alcohol.
2. Cocaína.
3. Heroína.
4. Tabaco.
5. Cannabis.

Respuesta correcta: 2. Cocaína.